Unen a las células epiteliales entre sí:
1. Cadherinas.
2. Integrinas.
3. Fibronectinas.
4. Elastinas.
5. Lamininas.

Respuesta correcta: 1. Cadherinas.